Clinical trial inclusion criterion:
3. Right heart catheterization performed at Screening with results that are:

Annotated entities:
- Parsing_Error: "3."
- Procedure: "Right heart catheterization"
- Parsing_Error: "Right heart catheterization performed at Screening with results that are:"
- Temporal: "performed at Screening"
- Reference_point: "Screening"